What are Drosophila's balancer chromosomes?

balancer chromosomes are genetic reagents used for stock maintenance and mutagenesis screens